下列何種細胞的抗原接受器（antigen receptor）會進行體細胞高度突變（somatic hypermutation）？
A. T細胞
B. B細胞
C. 巨噬細胞
D. 自然殺手細胞

正確答案：B. B細胞